下列何者是停經後婦女使用荷爾蒙替代治療（hormonal replacement therapy）的適應症？
A. 有乳癌之家族史
B. 三酸甘油酯過高症
C. 子宮內膜癌
D. 潮紅（flushing）及生殖泌尿道症狀

正確答案：D. 潮紅（flushing）及生殖泌尿道症狀